Naïve cannabis patients with chronic non-cancer and cancer pain (not used cannabis in any presentation in the last 12 weeks)

The above is a clinical trial inclusion criterion. Annotated with entity spans:
[Condition: Naïve cannabis] patients with [Qualifier: chronic] [Qualifier: non-cancer] and [Qualifier: cancer] [Condition: pain] ([Measurement: not] used [Drug: cannabis] in any presentation [Temporal: in the last 12 weeks])